腹主動脈在下列何平面分枝成左右總腸骨動脈？
A. 橫幽門面（transpyloric plane）
B. 橫臍面（transumbilical plane）
C. 橫腸骨結節面（transtubercular plane）
D. 腸骨嵴間面（intercrestal plane）

正確答案：D. 腸骨嵴間面（intercrestal plane）